下列何者非治療重症肌無力症之正確方式?
A. 抗膽鹼脂藥物（anticholinesterase drugs）
B. 類固醇藥物（corticosteroid）
C. 胸腺切除術（thymectomy）
D. 病人感染時使用aminoglycoside藥物

正確答案：D. 病人感染時使用aminoglycoside藥物